Clinical trial exclusion criterion:
Pregnant or nursing

Annotated entities:
- Condition: "Pregnant"
- Condition: "nursing"